一名 2 歲小孩因胃脹嘔吐就醫，檢查發現十二指腸阻塞，他最可能罹患以下何種先天性異常疾病？
A. 胰臟發育不全（Pancreatic agenesis）
B. 胰臟分裂（Bifid pancreas）
C. 環狀胰臟（Annular pancreas）
D. 異位性胰臟（Ectopic pancreas）

正確答案：C. 環狀胰臟（Annular pancreas）